Patients willing and able to sign the informed consent

The above is a clinical trial inclusion criterion. Annotated with entity spans:
[Informed_consent: Patients willing and able to sign the informed consent]